40 餘歲女性出現眼睛疼痛、疲憊、消瘦、雙手顫抖等症狀，檢查結果為甲狀腺功能過高，且出現促甲狀腺荷爾蒙受體（TSH receptor）抗體的葛瑞夫氏症（Graves' disease）。這個疾病的成因為何？
A. 感染症破壞甲狀腺體，引起功能過高
B. 產生出自體抗體的自體免疫疾病
C. 攝取碘質過多，引起甲狀腺功能過高
D. 電解質代謝失常，引起甲狀腺功能過高

正確答案：B. 產生出自體抗體的自體免疫疾病